兩歲女童有生長遲緩（growth failure），血液檢查顯示血中白血球數為 9,600/mm3，中性球 45%，淋巴球 48%，單核球 7%；血色素（hemoglobin）值為 11.6 g/dL；血小板數為 360,000/mm3；血中鉀離子濃度為 2.8 mmol/L，鈉離子濃度為 133 mmol/L，血中氯離子濃度為 104 mmol/L，血中 pH 值為 7.2，重碳酸根（HCO3-）離子濃度為 18 mmol/L，尿液的 pH 值為 6.5。請計算女童血中的陰離子間隙（anion gap）？
A. 13.8 mmol/L
B. 8.2 mmol/L
C. 11 mmol/L
D. 18 mmol/L

正確答案：C. 11 mmol/L